Clinical trial exclusion criterion:
Plasma donation within one month of screening or any blood donation/blood loss > 500 mL within 3 months prior to screening or during the study.

Annotated entities:
- Procedure: "Plasma donation"
- Temporal: "within one month of screening"
- Reference_point: "screening"
- Procedure: "blood donation"
- Measurement: "blood loss"
- Value: "> 500 mL"
- Temporal: "within 3 months prior to screening"
- Temporal: "during the study"